pregnant or breast feeding

The above is a clinical trial exclusion criterion. Annotated with entity spans:
[Condition: pregnant] or [Observation: breast feeding]